Describe the role of epidermal CYLD inactivation in sebaceous and basaloid skin tumors

Epidermal CYLD inactivation sensitizes mice to the development of sebaceous and basaloid skin tumors.